Un paciente de 26 años de edad sin antecedentes médico-quirúrgicos previos acude a urgencias por disnea de 15 días de evolución. En la exploración física no se detecta ningún hallazgo de interés excepto un nódulo de consistencia dura en el testículo izquierdo. Se realiza una radiografía de tórax objetivándose múltiples nódulos pulmonares en "suelta de globos". En su analítica destacan una B-hCG de 30.000 mIU/ml. ¿Cuál le parece el origen más probable de la patología de este cuadro?
1. Seminoma.
2. Angiomiolipoma renal.
3. Tumor de Wilms.
4. Coriocarcinoma testicular.
5. Linfoma no Hodgkin.

Respuesta correcta: 4. Coriocarcinoma testicular.